Clinical trial exclusion criterion:
Subject who would receive more than 4500 euros of compensation due to his participation in other biomedical research in the 12 months preceding this study

Annotated entities:
- Non-query-able: "Subject who would receive more than 4500 euros of compensation due to his participation in other biomedical research in the 12 months preceding this study"